What type of genome, (RNA or DNA, double stranded single stranded) is found in the the virus that causes blue tongue disease?

Bluetongue virus (BTV) genome contains ten double-stranded RNA segments